骨折手術後，下列那一種運動最能避免骨關節受到不恰當的受力？
A. 等長性收縮（isometric contraction）
B. 向心性等張式收縮（concentric isotonic contraction）
C. 離心性等張式收縮（eccentric isotonic contraction）
D. 等速性收縮（isokinetic contraction）

正確答案：A. 等長性收縮（isometric contraction）